Patients allergic to lidocaine or adhesive

The above is a clinical trial exclusion criterion. Annotated with entity spans:
Patients [Condition: allergic] to [Drug: lidocaine] or [Drug: adhesive]